Hamilton Depression Rating Scale-17 score greater than 18.

The above is a clinical trial inclusion criterion. Annotated with entity spans:
[Measurement: Hamilton Depression Rating Scale]-17 score [Value: greater than 18].